Both 'incident' (i.e. new) patients and 'flare' patients can be included.

The above is a clinical trial inclusion criterion. Annotated with entity spans:
[Non-query-able: Both 'incident' (i.e. new) patients and 'flare' patients can be included].